Clinical trial exclusion criterion:
addiction to alcohol or recreational drugs

Annotated entities:
- Condition: "addiction to alcohol"
- Condition: "addiction to recreational drugs"